Clinical trial exclusion criterion:
Uncontrolled diabetes defined as HbA1c above 70 mmol/mol and insufficient nutritional status.

Annotated entities:
- Condition: "Uncontrolled diabetes"
- Measurement: "HbA1c"
- Value: "above 70 mmol/mol"
- Condition: "insufficient nutritional status"